鼻咽癌病人來看診時之臨床表徵以何者最多？
A. 流鼻血
B. 鼻塞
C. 中耳積水
D. 頸部腫瘤

正確答案：D. 頸部腫瘤